在門齒窩（incisive fossa）處注入麻醉劑，主要阻斷下列何神經？
A. 鼻腭神經（nasopalatine n.）
B. 腭大神經（greater palatine n.）
C. 前上齒槽神經（anterior superior alveolar n.）
D. 腭小神經（lesser palatine n.）

正確答案：A. 鼻腭神經（nasopalatine n.）